Clinical trial exclusion criterion:
Other acquired or inherited causes of liver disease: alcoholic liver disease, obesity induced liver disease, drug related liver disease, auto-immune hepatitis, hemochromatosis, Wilson's disease or alpha-1 antitrypsin deficiency

Entity relations:
- Has_qualifier("liver disease", "acquired")
- Subsumes("liver disease", "alcoholic liver disease")
- OR("acquired", "inherited")
- OR("alcoholic liver disease", "obesity induced liver disease", "drug related liver disease", "auto-immune hepatitis", "hemochromatosis", "Wilson's disease", "alpha-1 antitrypsin deficiency")